腫瘤旁症候群（paraneoplastic syndrome）中，副甲狀腺素相關胜肽（parathyroid hormonerelated peptide）的產生最常見於何種肺癌的組織學型態？
A. 小細胞肺癌（small cell lung cancer）
B. 腺癌（adenocarcinoma）
C. 狀細胞癌（squamous cell carcinoma）
D. 大細胞肺癌（large cell carcinoma）

正確答案：C. 狀細胞癌（squamous cell carcinoma）